Clinical trial exclusion criterion:
Resting heart rate <45 bpm or >90 bpm at screening.

Annotated entities:
- Measurement: "Resting heart rate"
- Value: "<45 bpm"
- Value: ">90 bpm"
- Temporal: "at screening"
- Reference_point: "screening"